Clinical trial inclusion criterion:
>= 18 years old the day of inclusion

Annotated entities:
- Person: "old"
- Value: ">= 18 years"